La orina es hipoosmolar respecto al plasma en:
1. Cápsula de Bowman.
2. Túbulo proximal.
3. Zona medular del asa de Henle.
4. Zona inicial del túbulo distal.
5. Túbulo colector en presencia de ADH.

Respuesta correcta: 4. Zona inicial del túbulo distal.